Infection at the injection site

The above is a clinical trial exclusion criterion. Annotated with entity spans:
[Condition: Infection] at the [Qualifier: injection site]